Clinical trial exclusion criterion:
Subjects not able to give informed consent

Annotated entities:
- Negation: "not"
- Informed_consent: "give informed consent"
- Mood: "able to"